Body mass index greater than 40 kg / m2

The above is a clinical trial exclusion criterion. Annotated with entity spans:
[Measurement: Body mass index] [Value: greater than 40 kg / m2]